Clinical trial exclusion criterion:
Pregnancy or breastfeeding (disproved by a negative pregnancy test before trial inclusion)

Entity relations:
- Has_value("pregnancy test", "negative")
- Has_index("before trial inclusion", "trial inclusion")
- Has_temporal("pregnancy test", "before trial inclusion")
- Has_negation("pregnancy test", "disproved by")
- OR("Pregnancy", "breastfeeding")